Clinical trial inclusion criterion:
Subject demonstrating an IIEF-5 drug-free baseline score that is = 10 but = 16, and an IIEF-5 tadalafil-alone baseline score that is = 18

Entity relations:
- Has_value("IIEF-5 drug-free baseline score", "= 10 but = 16")
- Has_value("IIEF-5 tadalafil-alone baseline score", "= 18")